Clinical trial inclusion criterion:
= 50 years and in postmenopausal state > 1 year

Entity relations:
- Has_temporal("postmenopausal state", "> 1 year")
- Has_value("years", "= 50")